Performed spirometry at Visit 1 and Visit 2 and willing to perform spirometry at Visit 3

The above is a clinical trial inclusion criterion. Annotated with entity spans:
Performed [Procedure: spirometry] [Temporal: at Visit 1] and [Reference_point: Visit 2] and [Mood: willing to perform] [Procedure: spirometry] [Temporal: at Visit 3]